Clinical trial exclusion criterion:
Cannot communicate with investigators

Annotated entities:
- Observation: "Cannot communicate"